Patients must agree to have a 20 cc blood sample drawn in addition to routine labs with each cycle of chemotherapy.

The above is a clinical trial inclusion criterion. Annotated with entity spans:
Patients must [Informed_consent: agree to] have a [Qualifier: 20 cc] [Procedure: blood sample drawn] in addition to [Procedure: routine labs] [Multiplier: with each cycle of chemotherapy].